Clinical trial exclusion criterion:
Resting bradycardia (< 50 beats/min), frequent multifocal PVCs, complex ventricular arrhythmia, sustained SVT

Annotated entities:
- Condition: "Resting bradycardia"
- Value: "< 50 beats/min"
- Condition: "multifocal PVCs"
- Multiplier: "frequent"
- Condition: "complex ventricular arrhythmia"
- Condition: "sustained SVT"